Clinical trial inclusion criterion:
A formal diagnosis of Autism or Pervasive Developmental Disorder not otherwise specified (PDD-NOS), given by a child neurologist.

Entity relations:
- Subsumes("Pervasive Developmental Disorder not otherwise specified", "PDD-NOS")
- OR("Autism", "Pervasive Developmental Disorder not otherwise specified")